Clinical trial inclusion criterion:
Able to understand and provide informed consent for participation.

Annotated entities:
- Informed_consent: "Able to understand and provide informed consent for participation"